Clinical trial exclusion criterion:
Supine systolic blood pressure <85 mm Hg or >200 mm Hg at screening.

Annotated entities:
- Measurement: "systolic blood pressure"
- Qualifier: "Supine"
- Value: "<85 mm Hg"
- Value: ">200 mm Hg"